根據美國疾病管制署對人類免疫不全病毒（HIV）感染及相關機遇性感染與腫瘤的分類，下列何種惡性腫瘤不是後天免疫不全症候群相關疾病（AIDS-defining conditions）？
A. Hodgkin's lymphoma
B. Kaposi's sarcoma
C. Burkitt's lymphoma
D. invasive cervical carcinoma

正確答案：A. Hodgkin's lymphoma